Clinical trial inclusion criterion:
Chest radiograph showing new opacities.

Entity relations:
- Has_qualifier("opacities", "new")
- AND("Chest radiograph", "opacities")